罕見的單基因（monogenic）糖尿病，其致病基因已有6種以上，其中一種是葡萄糖代謝相關的酶hexokinase IV （glucokinase）發生突變，關於該酶之敘述，下列何者錯誤？
A. 該酶作用參與糖解反應（glycolysis）
B. 該酶基因突變會直接增加TCA cycle之反應速率
C. 該酶基因突變會導致胰島細胞ATP生成減少
D. 該酶會磷酸化葡萄糖

正確答案：B. 該酶基因突變會直接增加TCA cycle之反應速率